diagnosed with stable chronic heart failure NYHA class II-III

The above is a clinical trial inclusion criterion. Annotated with entity spans:
diagnosed with [Qualifier: stable] [Condition: chronic heart failure] [Measurement: NYHA class] [Value: II-III]